Según la última formulación de la teoría de C.L. Hull, para que una conducta se lleve a cabo:
1. Sólo es necesario que exista un hábito.
2. Se requiere, únicamente, la existencia de un impulso o necesidad.
3. Se requiere que exista un hábito y que estén presentes tanto un impulso como un incentivo.
4. Se requiere que exista un hábito y que estén presentes un impulso o un incentivo (pero no necesariamente ambos).

Respuesta correcta: 3. Se requiere que exista un hábito y que estén presentes tanto un impulso como un incentivo.